Clinical trial exclusion criterion:
History of reaction to study antibiotics,

Entity relations:
- AND("History", "reaction")
- AND("reaction", "study antibiotics")